Clinical trial exclusion criterion:
Neutrophil count <1500 cells/mm3 or platelet count <90,000 cells/mm3 at screening.

Annotated entities:
- Measurement: "Neutrophil count"
- Value: "<1500 cells/mm3"
- Measurement: "platelet count"
- Value: "<90,000 cells/mm3"
- Temporal: "at screening"